Hepatitis B e antigen (HBeAg)-negative.

The above is a clinical trial inclusion criterion. Annotated with entity spans:
[Measurement: Hepatitis B e antigen] ([Measurement: HBeAg])-[Value: negative].